Clinical trial inclusion criterion:
Currently living in a stable environment

Annotated entities:
- Observation: "living in a stable environment"